下列有關醫療廣告之敘述，何者錯誤？
A. 廣告內容暗示或影射醫療業務者，視為醫療廣告
B. 醫療廣告得利用贈與醫療刊物為宣傳
C. 醫學新知未涉及招徠醫療業務者，不視為醫療廣告
D. 醫療廣告不得以公開祖傳秘方或公開答問為宣傳

正確答案：B. 醫療廣告得利用贈與醫療刊物為宣傳